關於眼皮成形術（blepharoplasty）之敘述，下列何者錯誤？
A. 因淚腺（lacrimal gland）造成之側面鼓突（lateral fullness）佔 10-15%
B. 因淚腺造成之側面鼓突可考慮部分切除
C. capsulopalpebral fascia 是在較高之位置和 septum 接連在一起
D. 在切除內側眼脂肪（medial border fat）時，要注意上眼眶神經（superior orbital nerve）

正確答案：B. 因淚腺造成之側面鼓突可考慮部分切除